Clinical trial inclusion criterion:
Gastrectomy (subtotal or total)

Entity relations:
- Has_qualifier("Gastrectomy", "subtotal")
- OR("subtotal", "total")